Clinical trial exclusion criterion:
The patient has bony lesions as the sole evaluable disease.

Entity relations:
- Has_qualifier("the sole", "evaluable disease")
- Has_value("bony lesions", "the sole")